Body mass index to be between 18 to 30 kg/m2 (inclusive) as calculated by weight(Kg)/height(m2).

The above is a clinical trial inclusion criterion. Annotated with entity spans:
[Measurement: Body mass index] to be [Value: between 18 to 30 kg/m2] (inclusive) as calculated by weight(Kg)/height(m2).